Accepted for CABG surgery

The above is a clinical trial inclusion criterion. Annotated with entity spans:
[Mood: Accepted for] [Procedure: CABG surgery]